Allergy, or have experienced any drug reaction to ketamine

The above is a clinical trial exclusion criterion. Annotated with entity spans:
[Condition: Allergy], or have experienced any [Condition: drug reaction] to [Drug: ketamine]